Clinical trial exclusion criterion:
Protocol-determined chemotherapy hydration

Entity relations:
- Has_qualifier("chemotherapy hydration", "Protocol-determined")